下列關於醫院所採行的整體策略何者錯誤？
A. 可包含成長策略、穩定策略、緊縮策略及混合策略
B. 垂直整合屬於穩定策略
C. 作業流程的再造與合理化屬於穩定策略
D. 混合策略可以是內科部採成長策略，小兒科部採緊縮策略

正確答案：B. 垂直整合屬於穩定策略